Clinical trial exclusion criterion:
History of malignancy including leukemia and lymphoma (but not basal cell skin carcinoma) within the past five years

Annotated entities:
- Condition: "malignancy"
- Condition: "leukemia"
- Condition: "lymphoma"
- Condition: "basal cell skin carcinoma"
- Temporal: "within the past five years"